乳糜管（lacteal）分布於小腸的那一層？
A. 黏膜固有層（lamina propria）
B. 黏膜下層（submucosa）
C. 黏膜肌層（muscularis mucosae）
D. 漿膜層（serosa）

正確答案：A. 黏膜固有層（lamina propria）